一位35歲男子從常規的醫療檢查被診斷出患有B型肝炎，肝功能正常，血清甲型胎兒蛋白（α-fetoprotein, AFP）在正常範圍內。對這病人的建議，下列何者錯誤？
A. 每6個月門診追蹤
B. 每6個月血清甲型胎兒蛋白（α-fetoprotein, AFP）檢查
C. 每6個月腹部電腦斷層掃描
D. 每6個月肝功能檢查

正確答案：C. 每6個月腹部電腦斷層掃描